How many genes are imprinted in the human genome?

Among approximately 70 known imprinted genes are some causing disorders affecting growth, metabolism and cancer predisposition.